Male and female Active-duty SMs or Veterans aged 18 or older who are in good general health.

The above is a clinical trial inclusion criterion. Annotated with entity spans:
[Person: Male] and [Person: female] [Person: Active-duty SMs] or [Person: Veterans] [Person: aged] [Value: 18 or older] who are in [Condition: good general health].